Clinical trial inclusion criterion:
Diagnosis of diabetes according ADA criteria:

Annotated entities:
- Condition: "diabetes"
- Qualifier: "ADA criteria"